Clinical trial exclusion criterion:
Currently participating in any other clinical research study.

Annotated entities:
- Competing_trial: "Currently participating in any other clinical research study."